Uncontrolled Heart Failure or NYHA Class III or IV heart failure

The above is a clinical trial exclusion criterion. Annotated with entity spans:
[Qualifier: Uncontrolled] [Condition: Heart Failure] or [Qualifier: NYHA Class III] or IV [Condition: heart failure]